Disminuye el gasto cardíaco el aumento de:
1. La volemia.
2. El retorno venoso.
3. La actividad vagal.
4. El volumen telediastólico.
5. La contractilidad miocárdica.

Respuesta correcta: 3. La actividad vagal.